Clinical trial inclusion criterion:
Resting functional residual capacity (FRC) >120% predicted;

Entity relations:
- Has_value("Resting functional residual capacity (FRC)", ">120% predicted")